Clinical trial inclusion criterion:
Patients who have been monitored without complication such as acute rejection.

Entity relations:
- Has_negation("complication", "without")
- Subsumes("complication", "acute rejection")